Clinical trial exclusion criterion:
laparoscopic bowel or solid organ resection except laparoscopic cholecystectomy

Annotated entities:
- Procedure: "laparoscopic bowel resection"
- Procedure: "solid organ resection"
- Procedure: "laparoscopic cholecystectomy"
- Negation: "except"